70歲男性抽菸近50年，有多年長期咳嗽及運動時呼吸困難症狀，近日咳嗽及呼吸困難加劇前往急診處就醫。身體診查發現病人意識清楚，血壓穩定，但呼吸快速及胸部聽診有呼氣喘鳴聲（wheezes）。胸部X光片沒有肺炎之現象，痰液不多，其呼吸空氣時動脈血液氣體分析顯示pH 7.274，pCO2 78 mmHg，pO2  40 mmHg， mEq/L，BE(ECF) +9 mEq/L。給予氧氣後，下列何種處理最為正確？
A. 給予重碳酸鈉輸液來改善酸血症
B. 迅速給予氣管內插管及使用呼吸器以改善pCO2至40 mmHg
C. 給予茶鹼（aminophylline）靜脈注射治療
D. 先給予支氣管擴張劑吸入治療，並考慮使用非侵襲性呼吸器治療

正確答案：D. 先給予支氣管擴張劑吸入治療，並考慮使用非侵襲性呼吸器治療